Clinical trial inclusion criterion:
Aspartate aminotransferase (AST)/Alanine aminotransferase (ALT) <10x upper limit of normal

Annotated entities:
- Measurement: "Aspartate aminotransferase (AST)"
- Measurement: "Alanine aminotransferase (ALT)"
- Value: "<10x upper limit of normal"